Clinical trial exclusion criterion:
Diagnosis or h/o PTSD, depression, substance use, mental health problems, sleep disorders, HPA disruption and/or TBI

Annotated entities:
- Condition: "PTSD"
- Condition: "depression"
- Condition: "substance use"
- Condition: "mental health problems"
- Condition: "sleep disorders"
- Condition: "HPA disruption"
- Condition: "TBI"